Currently on the active heart transplant list

The above is a clinical trial exclusion criterion. Annotated with entity spans:
Currently on the [Mood: active heart transplant list]